下列何者在急性中風時最易發生癲癇？
A. 額葉部腦出血（frontal lobe hemorrhage）
B. 視丘腦出血（thalamic hemorrhage）
C. 上矢靜脈竇栓塞（superior sagittal sinus thrombosis）
D. 中大腦動脈梗塞（middle cerebral artery infarction）

正確答案：C. 上矢靜脈竇栓塞（superior sagittal sinus thrombosis）